Adult women at least 18 years of age

The above is a clinical trial inclusion criterion. Annotated with entity spans:
[Person: Adult] [Person: women] [Value: at least 18 years] of [Person: age]